Causes of PH other than that of heart failure, such as: chronic thromboembolic PH, sickle-cell disease, or sarcoidosis

The above is a clinical trial exclusion criterion. Annotated with entity spans:
[Condition: Causes of PH] [Negation: other than] that of [Condition: heart failure], such as: [Condition: chronic thromboembolic PH], [Condition: sickle-cell disease], or [Condition: sarcoidosis]